¿Cómo se denomina el proceso de transporte de agua a través de las membranas, que depende de la concentración de solutos?:
1. Filtración.
2. Transporte activo.
3. Difusión facilitada.
4. Ósmosis.

Respuesta correcta: 4. Ósmosis.